下列何者為最主要的吸氣肌肉？
A. 橫膈肌（diaphragm）
B. 外肋間肌（external intercostal muscles）
C. 內肋間肌（internal intercostal muscles）
D. 胸鎖乳突肌（sternocleidomastoids）

正確答案：A. 橫膈肌（diaphragm）